Which disease is treated with Nusinersen?

Nusinersen us used for treatment of Spinal Muscular Atrophy.